Clinical trial inclusion criterion:
>18 to < 90 years old

Annotated entities:
- Person: "old"
- Value: ">18 to < 90 years"